Clinical trial exclusion criterion:
Active pathological bleeding

Entity relations:
- Has_temporal("pathological bleeding", "Active")